Clinical trial exclusion criterion:
2. Has not had a GTC seizure within the last year AND is not expected to have a reduction of anti-epileptic drugs during their hospital admission.

Annotated entities:
- Parsing_Error: "2."
- Condition: "GTC seizure"
- Negation: "not"
- Temporal: "within the last year"
- Drug: "anti-epileptic drugs"
- Procedure: "reduction of anti-epileptic drugs"
- Temporal: "during their hospital admission"
- Reference_point: "hospital admission"
- Negation: "not"